有關膿胸（empyema）之敘述，下列何者錯誤？
A. 依據臨床及病理表現，可分為 acute, fibropurulent, organizing 三期
B. 癌症是最常造成胸膜滲出物（exudative pleural effusion）的原因
C. 治療抗生素須使用 6 星期以上
D. 約有 50～60%的膿胸由肺部感染而來

正確答案：B. 癌症是最常造成胸膜滲出物（exudative pleural effusion）的原因